Which gene is responsible for red hair?

Red hair is the null phenotype of MC1R.  Loss-of-function mutations at the MC1R are associated with a switch from eumelanin to phaeomelanin production, resulting in a red or yellow coat colour.